Clinical trial exclusion criterion:
Concomitant medications that fall into the categories below could potentially lead to adverse reactions and should be considered cautionary.

Annotated entities:
- Undefined_semantics: "Concomitant medications that fall into the categories below could potentially lead to adverse reactions and should be considered cautionary."
- Context_Error: "Concomitant medications that fall into the categories below could potentially lead to adverse reactions and should be considered cautionary."